Clinical trial exclusion criterion:
Patients with cardiogenic shock - Killip Class 4

Entity relations:
- Has_value("Killip Class", "4")
- AND("cardiogenic shock", "Killip Class")